Clinical trial exclusion criterion:
Patients with upper face botulinum toxin injection in the past 12 months

Entity relations:
- Has_qualifier("botulinum toxin injection", "upper face")
- Has_temporal("botulinum toxin injection", "in the past 12 months")